下列有關恙蟲病（scrub typhus）之敘述，何者錯誤？
A. 其致病原在自然界中以鼠類為主要儲菌宿主（reservoir host）
B. 臺閩地區之病媒蟎種主要為地里恙蟎（Leptotrombidium deliense）
C. 恙蟲病為一種廣泛世界性分布之人畜共通傳染病
D. 人類感染而未能及時治療之死亡率約 1～60%

正確答案：C. 恙蟲病為一種廣泛世界性分布之人畜共通傳染病